Clinical trial inclusion criterion:
Have a planned surgical procedure or clinical situation that would allow objective neuromuscular monitoring techniques to be applied with access to the arm for neuromuscular transmission monitoring.

Annotated entities:
- Mood: "planned"
- Procedure: "surgical procedure"
- Condition: "clinical situation"
- Procedure: "objective neuromuscular monitoring techniques"
- Qualifier: "that would allow objective neuromuscular monitoring techniques to be applied"